History of tobacco or tobacco product use unless abstinent for at least one year prior to the Screening Visit. This criterion does not apply to heterozygous subjects.

The above is a clinical trial exclusion criterion. Annotated with entity spans:
[Temporal: History] of [Condition: tobacco] or [Condition: tobacco product use] [Negation: unless] [Condition: abstinent] [Temporal: for at least one year prior to the Screening Visit]. [Parsing_Error: This criterion does not apply to heterozygous subjects.]